Clinical trial exclusion criterion:
Known renal function disorders (MDRD <ô0)

Entity relations:
- Has_value("MDRD", "<ô0")
- Subsumes("renal function disorders", "MDRD")